一棒球投手在一場比賽後，肩部劇痛，經檢查診斷為肩旋轉袖傷害（rotator cuff injury），下列那一個肩旋轉袖肌肉最可能受傷？
A. 三角肌（deltoid）
B. 臂三頭肌（triceps brachii）
C. 胸大肌（pectoralis major）
D. 棘突上肌（supraspinatus）

正確答案：D. 棘突上肌（supraspinatus）